Clinical trial inclusion criterion:
Inclusion criteria controls: Matching patients on age (+/- 2 years), sex and parental socioeconomic status, Age 18-45 years, No psychiatric or physical disease.

Entity relations:
- Has_negation("psychiatric disease", "No")
- Has_negation("physical disease", "No")
- Has_value("Age", "18-45 years")
- AND("controls", "Age")
- AND("controls", "psychiatric disease")
- OR("psychiatric disease", "physical disease")